Clinical trial exclusion criterion:
Administration of antineoplastic and immunomodulating agents or radiotherapy within 90 days prior to informed consent.

Annotated entities:
- Drug: "immunomodulating agents"
- Drug: "antineoplastic agents"
- Procedure: "radiotherapy"
- Temporal: "within 90 days prior to informed consent"
- Reference_point: "informed consent"